Clinical trial exclusion criterion:
Signs of life-threatening cerebral edema or multi-organ failure upon presentation to the emergency room or pediatric intensive care unit

Annotated entities:
- Condition: "cerebral edema"
- Condition: "multi-organ failure"
- Mood: "Signs of"
- Qualifier: "life-threatening"
- Visit: "emergency room"
- Visit: "pediatric intensive care unit"
- Temporal: "upon presentation to the emergency room or pediatric intensive care unit"
- Reference_point: "presentation to the emergency room or pediatric intensive care unit"